Clinical trial exclusion criterion:
Patients on longstanding NSAID therapy

Annotated entities:
- Procedure: "NSAID therapy"
- Temporal: "longstanding"